下列何者是 nonsteroidal antiinflammatory drugs（NSAIDs）的直接藥理機轉？
A. 抑制 prostaglandins 的形成
B. 釋放出 substance P
C. 直接作用在μ-opioid 接受器上
D. 抑制 substance P 的釋放

正確答案：A. 抑制 prostaglandins 的形成